Clinical trial exclusion criterion:
Drug/alcohol abuse: Subjects with a known or suspected history of alcohol or drug abuse within the last 2 years.

Entity relations:
- Has_temporal("alcohol abuse", "history")
- Has_temporal("alcohol abuse", "within the last 2 years")
- OR("Drug abuse", "alcohol abuse")
- OR("alcohol abuse", "drug abuse")